關於懷孕時期的敘述，下列何者正確？
A. 血色素（hemoglobin）上升
B. 到足月時總血量上升40%
C. 紅血球體積（red cell volume）一直到懷孕20週後才開始上升
D. 血比容積上升是由於紅血球體積上升多過於血漿體積而造成

正確答案：B. 到足月時總血量上升40%